Clinical trial exclusion criterion:
known or suspected bowel obstruction

Annotated entities:
- Mood: "known"
- Mood: "suspected"
- Condition: "bowel obstruction"